preterm birth

The above is a clinical trial exclusion criterion. Annotated with entity spans:
[Condition: preterm birth]